RNA降解後，CMP與UMP主要會被代謝成下列那一個中間產物？
A. β-aminoisobutyrate
B. thymine
C. uracil
D. hypoxanthine

正確答案：C. uracil